What is MINDY-1?

MINDY-1 (motif interacting with Ub-containing novel DUB family) is a member of an evolutionarily conserved and structurally distinct new family of deubiquitinating enzymes. Found in all eukaryotes, MINDY-family DUBs are highly selective at cleaving K48-linked polyUb, a signal that targets proteins for degradation. MINDY-1 prefers cleaving long polyUb chains and works by trimming chains from the distal end.